Patients requiring emergent cesarean birth

The above is a clinical trial exclusion criterion. Annotated with entity spans:
Patients requiring [Procedure: emergent cesarean birth]